Clinical trial inclusion criterion:
Available for the entire duration of the study and willing to participate on the basis of the information provided in the FIU duly read and signed.

Annotated entities:
- Informed_consent: "Available for the entire duration of the study and willing to participate on the basis of the information provided in the FIU duly read and signed."